一位 23 歲男性入急診，主訴為 20 分鐘前開始出現大量血便。病人自訴以前也有過血便經驗，因為症狀自動就消失所以都沒就醫。這次是在晚上排便時發生，他發現有大量鮮血伴隨著糞便一起排出，鮮血沾滿整個糞便表面，而糞便本身呈現黃色，肛門不會疼痛，除此以外無其他症狀。依病人的敘述，下列何種疾病可能性最高？
A. 外痔瘡（external hemorrhoid）
B. 內痔瘡（internal hemorrhoid）
C. 大腸癌（colon cancer）
D. 上消化道出血（upper gastrointestinal bleeding）

正確答案：B. 內痔瘡（internal hemorrhoid）